一位 75 歲輕度失智老人，於一年前其認知障礙漸進發生且逐漸惡化，於近半年動作緩慢易跌倒，常有意識混亂及幻覺的現象。神經學檢查軀幹僵直，四肢輕微顫抖。電腦斷層掃描顯示大腦泛發性萎縮。病人最可能罹患下列何種病？
A. 路易體失智症（dementia with Lewy bodies）
B. 阿茲海默症（Alzheimer disease）
C. 常壓性水腦症（normal-pressure hydrocephalus）
D. 庫賈氏症（Creutzfeldt-Jakob disease）

正確答案：A. 路易體失智症（dementia with Lewy bodies）